Clinical trial inclusion criterion:
Woman who had 2 miscarriage before 12(th) week of gestation.The patient who is diagnosed as thrombophilia with recurrent pregnancy loss. Signed consent form.

Annotated entities:
- Person: "Woman"
- Multiplier: "2"
- Condition: "miscarriage"
- Qualifier: "before 12(th) week of gestation"
- Temporal: "before 12(th) week of gestation"
- Reference_point: "12(th) week of gestation"
- Condition: "thrombophilia"
- Multiplier: "recurrent"
- Condition: "pregnancy loss"
- Informed_consent: "Signed consent form."